¿Cuál es el síntoma primario del Trastorno de Ansiedad Generalizada?:
1. La hiperlabilidad de la activación del sistema nervioso autónomo.
2. Las respuestas de evitación generalizadas.
3. La responsabilidad exagerada.
4. La preocupación excesiva e incontrolada.

Respuesta correcta: 4. La preocupación excesiva e incontrolada.